11. MRI finding healthy volunteers don't have sacral perineurial cysts, included in the negative control groupblank control group

The above is a clinical trial inclusion criterion. Annotated with entity spans:
11. [Post-eligibility: MRI finding healthy volunteers don't have sacral perineurial cysts, included in the negative control groupblank control group]